Clinical trial exclusion criterion:
clinically significant medical or neurologic condition or neurocognitive dysfunction that would affect function and/or task performance and/or interfere with the study protocol

Annotated entities:
- Qualifier: "clinically significant"
- Condition: "neurologic condition"
- Condition: "medical condition"
- Condition: "neurocognitive dysfunction"